Clinical trial exclusion criterion:
Presence or history of dysphagia or conditions predisposing to dysphagia (eg, uncontrolled gastroesophageal reflux disease [GERD], dyspepsia, etc)

Annotated entities:
- Condition: "dysphagia"
- Condition: "conditions predisposing to dysphagia"
- Condition: "gastroesophageal reflux disease"
- Qualifier: "uncontrolled"
- Condition: "GERD"
- Condition: "dyspepsia"
- Temporal: "history of"